Clinical trial exclusion criterion:
Breastfeeding

Annotated entities:
- Observation: "Breastfeeding"